Which topoisomerase is essential in yeast?

Yeast DNA topoisomerase II is encoded by a single-copy, essential gene.